Clinical trial exclusion criterion:
ileus

Annotated entities:
- Condition: "ileus"